下列那種細菌毒素的作用機制是抑制蛋白質的合成？
A. 志賀毒素（shiga toxin）
B. 霍亂毒素（cholera toxin）
C. 破傷風毒素（tetanospasmin）
D. 肉毒桿菌毒素（botulinum toxin）

正確答案：A. 志賀毒素（shiga toxin）